一位 37 歲女性，愛滋病及癌症患者，目前除了抗愛滋病藥物外，尚有使用 sulfonamides、cimetidine、 estrogen 及 tetracycline，因急性腹痛被診斷為急性胰臟炎，下列何種藥物最不可能是急性胰臟炎的原因？
A. sulfonamides
B. cimetidine
C. estrogen
D. tetracycline

正確答案：B. cimetidine